Los mastocitos o células cebadas pertenecen al tejido:
1. Epitelial.
2. Conjuntivo.
3. Adiposo
4. Linfoide.
5. Nervioso.

Respuesta correcta: 2. Conjuntivo.